下列何者最不可能與其他藥品造成 pharmacokinetic interaction？
A. bile acid sequestrants
B. tricyclic antidepressants
C. ketoconazole
D. acetaminophen

正確答案：D. acetaminophen